La enfermedad de Crohn:
1. Afecta únicamente al colon.
2. Se presenta como enfermedad perianal, con desarrollo de fístulas o abscesos.
3. Se caracteriza por afectación continua de la mucosa.
4. Está asociada con el consumo de alcohol.
5. Se inicia en la etapa infantil del individuo.

Respuesta correcta: 2. Se presenta como enfermedad perianal, con desarrollo de fístulas o abscesos.